下列有關下頜骨骨折（mandibular fractures）的敘述，何者錯誤？
A. 下頜骨的組成包含下頜骨聯合（symphysis），下頜骨體（body）、下頜角（angle）、下頜枝（ramus）、下頜髁突
B. 下頜骨骨折可以依據上下頜齒列的關係，Angle classification system分類為Class I、 Class II 及Class III
C. 上下頜齒列固定復位可用於無明顯位移、無齒列錯位及顳顎關節（temporo-mandibular joint）活動正常之情形
D. 手術治療主要為骨折處和上下頜齒列固定復位， 固定時間越久越好，不會有顳顎關節僵硬的問題

正確答案：D. 手術治療主要為骨折處和上下頜齒列固定復位， 固定時間越久越好，不會有顳顎關節僵硬的問題